Clinical trial inclusion criterion:
Agrees not to participate in another clinical study/trial during the study period or to participate in an investigational drug study for at least one month after last study session

Annotated entities:
- Competing_trial: "Agrees not to participate in another clinical study/trial during the study period or to participate in an investigational drug study for at least one month after last study session"